Clinical trial exclusion criterion:
Endogenous Cushing's

Annotated entities:
- Condition: "Cushing's"
- Qualifier: "Endogenous"